有關neuroendocrine tumors（NETs）的診治，以下敘述何者錯誤？
A. 組織病理學經常使用chromogranin A的免疫組織染色，協助診斷NETs
B. NETs的grading system根據proliferative indices（即Ki-67及mitotic count），分為Grade 1、Grade 2及
C. Multiple endocrine neoplasia type 1（MEN1）是一種autosomal dominant疾病，主要肇因於VHL gene的缺陷
D. 為控制腸胃道NET所導致的carcinoid syndrome，可使用somatostatin analogues

正確答案：C. Multiple endocrine neoplasia type 1（MEN1）是一種autosomal dominant疾病，主要肇因於VHL gene的缺陷